下列那一種病毒有兩條單股RNA基因體，其中一條為雙義（ambisense）RNA？
A. 拉薩病毒（Lassa virus）
B. 登革病毒（Dengue virus）
C. 中東呼吸症候群冠狀病毒（MERS-CoV）
D. 克里米亞-剛果出血熱病毒（Crimean-Congo hemorrhagic fever virus）

正確答案：A. 拉薩病毒（Lassa virus）